對孕婦來說，laparoscopic surgery最好的surgical position為：
A. prone position
B. lithotomy position
C. left lateral decubitus position
D. right lateral decubitus position

正確答案：C. left lateral decubitus position